What is the purpose of the LINCS Project?

The library of Integrated Cellular Signatures Project (LINCS) is an international effort for creating an annotated transcriptome and translating science into improved health care to benefit patients. TheLINCS aims to systematically map all human transcriptomes, chromosome by chromosome, in a gene-dependent manner through dedicated efforts from national and international teams.